Clinical trial inclusion criterion:
CRT <U+2267>250µm

Entity relations:
- Has_value("CRT", "250µm")